Clinical trial exclusion criteria:
History of documented clotting/coagulation disorder
History of cancer (within the last year)
Any diagnosis requiring anti-coagulation
History of hypersensitivity reaction to apixaban
Active clinically significant bleeding
Creatinine > 1.5 mg/dL
Participants currently receiving any type of anticoagulation or blood thinning medications, including heparin, low molecular weight heparins, Plavix, aspirin, NSAIDS
Combined P-glycoprotein and strong cytochrome P450 (CYP) 3A4 inhibitor
Combined P-glycoprotein and moderate CYP 3A4 inhibitor
Combined P-glycoprotein inducer and strong CYP 3A4 inducer
Inducers of p-glycoprotein
Strong inducers of CYP 3A4

Annotated entities:
- Condition: "coagulation disorder"
- Condition: "clotting disorder"
- Condition: "cancer"
- Temporal: "last year"
- Drug: "anti-coagulation"
- Condition: "hypersensitivity"
- Drug: "apixaban"
- Condition: "bleeding"
- Qualifier: "significant"
- Qualifier: "Active"
- Measurement: "Creatinine"
- Value: "> 1.5 mg/dL"
- Drug: "anticoagulation"
- Drug: "blood thinning medications"
- Drug: "heparin"
- Drug: "low molecular weight heparins"
- Drug: "Plavix"
- Drug: "aspirin"
- Drug: "NSAIDS"
- Drug: "P-glycoprotein inhibitor"
- Drug: "cytochrome P450 3A4 inhibitor"
- Qualifier: "strong"
- Drug: "P-glycoprotein inhibitor"
- Drug: "CYP 3A4 inhibitor"
- Qualifier: "moderate"
- Drug: "P-glycoprotein inducer"
- Drug: "CYP 3A4 inducer"
- Qualifier: "strong"
- Drug: "Inducers of p-glycoprotein"
- Drug: "inducers of CYP 3A4"
- Qualifier: "Strong"